5. Patient has contraindications to general anesthesia.

The above is a clinical trial exclusion criterion. Annotated with entity spans:
5. Patient has [Condition: contraindications to general anesthesia].